當血中之鉀離子濃度上升時，下列那一個激素分泌增加最明顯？
A. anti-diuretic hormone
B. angiotensinogen
C. aldosterone
D. atrial natriuretic peptide

正確答案：C. aldosterone